交感神經鏈（sympathetic chain）由横膈（diaphragm）的下列何處進入腹腔？
A. 正中弓狀韌帶（median arcuate ligament）下
B. 內側弓狀韌帶（medial arcuate ligament）下
C. 外側弓狀韌帶（lateral arcuate ligament）下
D. 主動脈孔（aortic hiatus）

正確答案：B. 內側弓狀韌帶（medial arcuate ligament）下